Clinical trial inclusion criterion:
Bishop-Score = 6

Annotated entities:
- Measurement: "Bishop-Score"
- Value: "= 6"